National Institute of Neurological and Communicative Disorders and Stroke / Alzheimer's Disease and Related Disorders Association (NINCDS/ADRDA) test positive for an Alzheimer's disease

The above is a clinical trial inclusion criterion. Annotated with entity spans:
[Measurement: National Institute of Neurological and Communicative Disorders and Stroke / Alzheimer's Disease and Related Disorders Association (NINCDS/ADRDA) test] [Value: positive] for an Alzheimer's disease